Clinical trial inclusion criteria:
current diagnosis of narcolepsy with cataplexy OR healthy control

Annotated entities:
- Condition: "narcolepsy"
- Condition: "cataplexy"
- Condition: "healthy"